Clinical trial inclusion criterion:
5. > 18 years old

Annotated entities:
- Value: "18 years"
- Person: "old"